Clinical trial inclusion criterion:
Have Chronic HCV infection prior to transplantation with documented HCV viremia = 1,000 IU/ml at screening and either documented HCV Ab positivity or HCV viremia = 1,000 IU/ml at least 6 months prior to enrollment.

Annotated entities:
- Condition: "Chronic HCV infection"
- Temporal: "prior to transplantation"
- Reference_point: "transplantation"
- Measurement: "HCV viremia"
- Value: "= 1,000 IU/ml"
- Measurement: "HCV Ab"
- Value: "positivity"
- Measurement: "HCV viremia"
- Value: "= 1,000 IU/ml"
- Temporal: "at least 6 months prior to enrollment."
- Reference_point: "enrollment"